El tratamiento quirúrgico del EPOC, o cirugía de reducción de volumen pulmonar, es actualmente un arma terapéutica más dentro del tratamiento multidisciplinario del mismo. ¿Cuál de las siguientes afirmaciones es correcta?
1. La indicación de tratamiento quirúrgico será en aquellos pacientes que presenten al mismo tiempo una insuficiencia cardíaca congestiva moderada/grave.
2. La presencia de una presión sistólica de la arteria pulmonar inferior a 45 es una contraindicación absoluta.
3. La EPOC con predominancia enfisematosa en lóbulos inferiores y medio asociada a patología pleural se asocia a mejores resultados.
4. La presencia de un enfisema de distribución difusa con un FEV1>20% y DLCO<20% son indicadores de buen pronóstico.
5. La rehabilitación prequirúrgica junto con la distribución del enfisema en los lóbulos superiores y la capacidad de realizar ejercicio físico postoperatorio hace que los resultados de la cirugía sean beneficiosos.

Respuesta correcta: 5. La rehabilitación prequirúrgica junto con la distribución del enfisema en los lóbulos superiores y la capacidad de realizar ejercicio físico postoperatorio hace que los resultados de la cirugía sean beneficiosos.